Clinical trial exclusion criterion:
no previously demonstrated clinically significant allergy or hypersensitivity to any of the excipients of the investigational medication administered in this trial

Entity relations:
- Has_qualifier("allergy", "clinically significant")
- AND("allergy", "excipients of the investigational medication")
- Has_temporal("allergy", "previously")
- OR("allergy", "hypersensitivity")